¿Cuál de los AINEs reseñados está estructuralmente relacionado con las pirazolonas?:
1. Ácido mefenámico.
2. Diclofenaco.
3. Metamizol.
4. Paracetamol.

Respuesta correcta: 3. Metamizol.